Clinical trial exclusion criterion:
A positive reaction for HIV infection, viral hepatitis B and hepatitis C;

Entity relations:
- Has_value("reaction for HIV infection", "positive")
- OR("reaction for HIV infection", "reaction for hepatitis C", "reaction for viral hepatitis B")